Clinical trial inclusion criterion:
Acute symptomatic BV

Annotated entities:
- Temporal: "Acute"
- Qualifier: "symptomatic"
- Condition: "BV"